Clinical trial exclusion criterion:
The participant has received neurosurgical intervention for Parkinson's disease (e.g., pallidotomy, thalamotomy, deep brain stimulation).

Entity relations:
- AND("neurosurgical intervention", "Parkinson's disease")
- Subsumes("neurosurgical intervention", "pallidotomy")
- OR("pallidotomy", "deep brain stimulation", "thalamotomy")